Suicidal patients and/or severe automutilation behavior and/or psychotic symptoms and/or lack of event memory.

The above is a clinical trial exclusion criterion. Annotated with entity spans:
[Condition: Suicidal] patients and/or [Qualifier: severe] [Condition: automutilation behavior] and/or [Condition: psychotic symptoms] and/or [Condition: lack of event memory].